Clinical trial exclusion criterion:
acute myocardial infarction, heart failure, neoplastic disease, chronic diseases that may affect the inflammatory profile both systemic and epicardial (cancer, chronic intestinal inflammation, hepatitis, AIDS); life expectancy < 6 months, previous CABG and/or other open heart surgery intervention, acute coronary syndrome

Annotated entities:
- Condition: "acute myocardial infarction"
- Condition: "heart failure"
- Condition: "neoplastic disease"
- Condition: "chronic diseases"
- Qualifier: "may affect the inflammatory profile"
- Qualifier: "systemic"
- Qualifier: "epicardial"
- Condition: "cancer"
- Condition: "chronic intestinal inflammation"
- Condition: "hepatitis"
- Condition: "AIDS"
- Observation: "life expectancy"
- Value: "< 6 months"
- Procedure: "CABG"
- Temporal: "previous"
- Procedure: "open heart surgery intervention"
- Condition: "acute coronary syndrome"
- Qualifier: "other"